Clinical trial exclusion criteria:
Chronic pain or narcotic usage during the preceding 30 days
Infection at or near the intended needle insertion site
Complex or altered abdominal wall anatomy
Weight <45kg

Annotated entities:
- Condition: "Chronic pain"
- Drug: "narcotic"
- Temporal: "during the preceding 30 days"
- Condition: "Infection"
- Qualifier: "intended needle insertion site"
- Condition: "altered abdominal wall anatomy"
- Condition: "Complex abdominal wall anatomy"
- Measurement: "Weight"
- Value: "<45kg"